Clinical trial inclusion criterion:
Has physician-diagnosed active nr-axSpA with disease duration <= 5 years

Entity relations:
- Has_qualifier("nr-axSpA", "active")
- Has_value("disease duration", "<= 5 years")
- Has_qualifier("nr-axSpA", "disease duration <= 5 years")